El proteasoma:
1. Está formado por 21 subunidades homólogas organizadas en 3 anillos.
2. Es un complejo proteico que cataliza la hidrólisis de proteínas ubicuitinadas.
3. Se encuentra únicamente en las células eucariotas animales.
4. Digiere proteínas aciladas.
5. Es activado por un medicamento, el bertezomil, en la terapia para el mieloma múltiple.

Respuesta correcta: 2. Es un complejo proteico que cataliza la hidrólisis de proteínas ubicuitinadas.